Available for the entire duration of the study and willing to participate on the basis of the information provided in the FIU duly read and signed.

The above is a clinical trial inclusion criterion. Annotated with entity spans:
[Informed_consent: Available for the entire duration of the study and willing to participate on the basis of the information provided in the FIU duly read and signed.]